Clinical trial inclusion criterion:
Measurable metastatic disease

Entity relations:
- Has_qualifier("metastatic disease", "Measurable")